Clinical trial inclusion criteria:
Written informed consent obtained
Male and female subjects aged 20 years or older at informed consent
Essential hypertension who had never received angiotensin II receptor antagonists and calcium channel blockers

Annotated entities:
- Informed_consent: "Written informed consent obtained"
- Person: "Male"
- Person: "female"
- Person: "aged"
- Value: "20 years or older"
- Temporal: "at informed consent"
- Reference_point: "informed consent"
- Condition: "Essential hypertension"
- Drug: "angiotensin II receptor antagonists"
- Drug: "calcium channel blockers"
- Negation: "never"